有關旅行者腹瀉（traveler's diarrhea）的敘述，下列何者最正確？
A. 最常造成旅行者腹瀉的病原體是Salmonella
B. 去東	亞國家旅遊發生腹瀉時，治療首選藥物為ciprofloxacin
C. azithromycin是治療的選擇之一，但孕婦不能使用
D. bismuth subsalicylate是預防的選擇，但小孩不建議使用

正確答案：D. bismuth subsalicylate是預防的選擇，但小孩不建議使用